Clinical trial exclusion criterion:
Taking other drugs which can influence the lipid profile (eg. Niacin, Fibrates;

Annotated entities:
- Qualifier: "other"
- Drug: "drugs"
- Qualifier: "can influence the lipid profile"
- Measurement: "lipid profile"
- Drug: "Niacin"
- Drug: "Fibrates"